70歲男性病患因疝氣而預行傳統修補手術，下列有關麻醉的考量，何者錯誤？
A. 半身麻醉（硬脊膜麻醉、脊椎麻醉）或神經阻斷
B. 半身麻醉的禁忌症只有病患拒絕、凝血異常與腦壓上升
C. 脊椎麻醉會引起血壓下降是由於交感神經阻斷
D. 脊椎麻醉除會引起血壓下降外，亦可能造成心跳變慢

正確答案：B. 半身麻醉的禁忌症只有病患拒絕、凝血異常與腦壓上升